Clinical trial inclusion criterion:
HBsAg positive at baseline

Annotated entities:
- Condition: "HBsAg positive"
- Temporal: "at baseline"